CC resistance (defined as failure of ovulation after receiving 150 mg/day of CC for 5 consecutive days per cycle, for at least 3 consecutive cycles).

The above is a clinical trial inclusion criterion. Annotated with entity spans:
[Drug: CC] [Condition: resistance] ([Non-query-able: defined as failure of ovulation after receiving 150 mg/day of CC for 5 consecutive days per cycle, for at least 3 consecutive cycles]).